What is the major adverse effect of adriamycin(doxorubicin)?

Cardiac toxicity is a major adverse effect caused by doxorubicin (DOX) therapy